Clinical trial exclusion criterion:
Patients with occult or prior HBV infection (defined as positive total hepatitis B core antibody [HBcAb] and negative HBsAg) may be included if HBV DNA is undetectable. These patients must be willing to undergo monthly DNA testing.

Entity relations:
- Has_value("HBsAg", "negative")
- Has_value("total hepatitis B core antibody [HBcAb]", "positive")
- Has_value("HBV DNA", "undetectable")
- AND("HBV infection", "total hepatitis B core antibody [HBcAb]")
- AND("HBV infection", "HBV DNA")
- AND("HBV infection", "HBsAg")